Clinical trial exclusion criteria:
Volunteers must not have been vaccinated against HPV-Gardasil-9 (both partners)
Any history of cervical, penile, oral or anal cancers
Being pregnant or plan on immediately becoming pregnant

Annotated entities:
- Negation: "not"
- Temporal: "have been"
- Procedure: "vaccinated"
- Condition: "HPV-Gardasil-9"
- Temporal: "Any history"
- Condition: "cancers cervical"
- Condition: "penile cancers"
- Condition: "oral cancers"
- Condition: "anal cancers"
- Condition: "pregnant"
- Mood: "plan on immediately becoming"
- Condition: "pregnant"